關於後天性截肢（acquired amputation）的原因，何者錯誤？
A. 下肢截肢最常見的原因是血管的疾病（vascular disease）
B. 下肢創傷性截肢（traumatic amputation）的年齡層大多分布在60～70歲
C. 上肢創傷性截肢的位置大多集中在手腕以下，以手指頭截肢（digital amputation）為大多數
D. 不論是上肢或下肢的截肢，腫瘤（tumor）是在兒童族群最常見的原因

正確答案：B. 下肢創傷性截肢（traumatic amputation）的年齡層大多分布在60～70歲